Clinical trial inclusion criterion:
Have normal screening laboratories for urine protein and urine glucose

Entity relations:
- Has_value("urine protein", "normal")
- Has_value("urine glucose", "normal")